Not requiring significant therapy modification owing to study therapy associated complications

The above is a clinical trial exclusion criterion. Annotated with entity spans:
[Non-query-able: Not requiring significant therapy modification owing to study therapy associated complications]